Women of child bearing potential must test negative on standard pregnancy test (urine or serum)

The above is a clinical trial inclusion criterion. Annotated with entity spans:
[Person: Women] of [Condition: child bearing potential] must test [Value: negative] on [Measurement: standard pregnancy test] ([Measurement: urine] or [Measurement: serum])